下列有關肺栓塞（pulmonary embolism）的診斷敘述，何者錯誤？
A. 氣促（dyspnea）、胸痛、咳血等症狀不具特異性
B. 診斷主要靠肺血管攝影（pulmonary angiography）
C. 血清中d-dimer的檢測具有高敏感度、低特異性的特點
D. 使用核醫通氣-灌注肺掃描檢查，會出現「通氣-灌注不吻合」（ventilation-perfusion mismatch）的影像

正確答案：B. 診斷主要靠肺血管攝影（pulmonary angiography）